Resting heart rate <60 beat per minute (bpm).

The above is a clinical trial exclusion criterion. Annotated with entity spans:
[Qualifier: Resting] [Measurement: heart rate] [Value: <60 beat per minute] (bpm).